¿Cuál de las siguientes especies de Candida spp, suele ser resistente o como mínimo tener una sensibilidad disminuida a fluconazol?
1. C. albicans.
2. C. tropicalis.
3. C. parapsilosis.
4. C. krusei.
5. C. giliermondii.

Respuesta correcta: 4. C. krusei.